Clinical trial exclusion criterion:
Patients will be excluded if they have known middle ear disease, chronic lung disease or claustrophobia

Entity relations:
- OR("middle ear disease", "claustrophobia", "chronic lung disease")